all adult patients with a nasal or facial skin/soft tissue defect requiring reconstruction limited to or including a full-thickness skin graft

The above is a clinical trial inclusion criterion. Annotated with entity spans:
all adult patients with a [Condition: nasal] or [Condition: facial skin/soft tissue defect] [Mood: requiring] [Procedure: reconstruction] limited to or including a [Device: full-thickness skin graft]